Clinical trial exclusion criterion:
allergic history or contraindication for any drugs in trials;

Entity relations:
- Has_qualifier("drugs in trials", "any")
- AND("contraindication", "drugs in trials")
- Has_temporal("allergic", "history")
- OR("allergic", "contraindication")